Clinical trial exclusion criterion:
Patients with epilepsy requiring medications (such as steroids or antiepileptic drugs)

Annotated entities:
- Condition: "epilepsy"
- Drug: "medications"
- Drug: "steroids"
- Drug: "antiepileptic drugs"